Clinical trial exclusion criterion:
weight <50kg or BMI =35 kg/m2

Annotated entities:
- Measurement: "weight"
- Value: "<50kg"
- Measurement: "BMI"
- Value: "=35 kg/m2"